下列藥物中何者可以降低腎素（renin）的活性，進而減少 angiotensin II 之生成？
A. Aliskiren
B. Hydrochlorothiazide
C. Losartan
D. Ramipril

正確答案：A. Aliskiren